一位 2 個月大的嬰兒因為幽門狹窄而有反覆性嘔吐（vomiting），臨床上會造成什麼現象？
A. 代謝性酸中毒（metabolic acidosis）
B. 代謝性鹼中毒（metabolic alkalosis）
C. 呼吸性酸中毒（respiratory acidosis）
D. 呼吸性鹼中毒（respiratory alkalosis）

正確答案：B. 代謝性鹼中毒（metabolic alkalosis）